Ovarian Reserve: number of antral follicles 2 millimeter (mm) between 6 <= antral follicle count (AFC) <= 16

The above is a clinical trial inclusion criterion. Annotated with entity spans:
Ovarian Reserve: [Measurement: number of antral follicles 2 millimeter (mm)] [Value: between 6 <= antral follicle count (AFC) <= 16]